法洛氏四合症（tetralogy of Fallot）之心雜音是何種畸形造成？
A. 肺動脈下漏斗體狹窄（infundibular stenosis）
B. 心室中隔缺損（ventricular septal defect）
C. 右心室肥厚（hypertrophic right ventricle）
D. 主動脈跨位（overriding of aorta）

正確答案：A. 肺動脈下漏斗體狹窄（infundibular stenosis）